Clinical trial exclusion criterion:
Significant periphery edema;

Entity relations:
- Has_qualifier("periphery edema", "Significant")